El almidón, como indicador en las valoraciones de yodo con tiosulfato:
1. No debe utilizarse nunca.
2. Debe añadirse al inicio de la valoración.
3. Debe añadirse inmediatamente antes del punto de equivalencia.
4. Sólo se añade en valoraciones en medio no acuoso.

Respuesta correcta: 3. Debe añadirse inmediatamente antes del punto de equivalencia.